Clinical trial exclusion criterion:
Ongoing need for psychoactive medication other than study medication [excepting stable doses (greater than three months duration) of anticonvulsant medication for seizure disorder, or diphenhydramine (Benadryl®)for sleep]

Annotated entities:
- Drug: "psychoactive medication"
- Drug: "study medication"
- Subjective_judgement: "stable doses"
- Temporal: "greater than three months"
- Drug: "anticonvulsant medication"
- Condition: "seizure disorder"
- Drug: "diphenhydramine"
- Negation: "other than"
- Negation: "excepting"